Has hepatitis C in which participants received therapy for HCV <4 weeks prior to receiving pembrolizumab

The above is a clinical trial exclusion criterion. Annotated with entity spans:
Has [Condition: hepatitis C] in which participants received [Procedure: therapy for HCV] [Temporal: <4 weeks prior] to [Reference_point: receiving pembrolizumab]